Clinical trial inclusion criterion:
ASA I-III patients scheduled for elective one or two level minimally invasive lumbar fusions

Annotated entities:
- Measurement: "ASA"
- Value: "I-III"
- Mood: "scheduled"
- Qualifier: "elective"
- Qualifier: "two level"
- Qualifier: "one level"
- Procedure: "minimally invasive lumbar fusions"